南部爆發登革熱大流行，若患者有下列何種臨床症狀時，醫師會診斷為登革病毒（dengue viruses）之感 染？①紅疹（rash） ②關節炎（arthritis） ③血小板減少（thrombocytopenia） ④出血熱（hemorrhagic fever）
A. ①②③
B. ①②④
C. ②③④
D. ①③④

正確答案：D. ①③④